Clinical trial exclusion criteria:
The participant has Modified Hoehn & Yahr stage 5 (or stage 5 at eather on-time or off-time for the participant with wearing off phenomenon).
The participant has severe dyskinesia.
The participant has unstable systemic disease.
The participant has a Mini-Mental State Examinations (MMSE) score of <= 24. psychiatric disease.
The participant has a history of clinically significant hypertension or other reactions associated with ingestion of tyramine-rich food.
The participant has received neurosurgical intervention for Parkinson's disease (e.g., pallidotomy, thalamotomy, deep brain stimulation).
The participant has received transcranial magnetic stimulation within 6 months.The participant has received selegiline, pethidine, tramadol, reserpine or methyldopa within 90 days.
The participant has received levodopa monotherapy, any psychoneurotic agent or antiemetic medication of dopamine agonist within 14 days. However, the participant has been receiving quetiapine or domperidone with a stable dose regimen for >= 14 days may be included in the study.
The participant is required to take any of the excluded medications or treatments.
The participant with laboratory data meeting any of the following:
Creatinine >= 2 x upper limit of normal (ULN)
Total bilirubin >= 2 x ULN
ALT or AST >= 1.5 x ULN
ALP >= 3 x ULN
The participant has received any of the excluded medications or treatments during.

Annotated entities:
- Measurement: "Modified Hoehn & Yahr"
- Value: "stage 5"
- Condition: "wearing off phenomenon"
- Temporal: "at on-time"
- Temporal: "at off-time"
- Value: "stage 5"
- Condition: "dyskinesia"
- Qualifier: "severe"
- Condition: "systemic disease"
- Undefined_semantics: "systemic disease"
- Qualifier: "unstable"
- Subjective_judgement: "unstable"
- Measurement: "Mini-Mental State Examinations (MMSE)"
- Value: "<= 24"
- Condition: "psychiatric disease"
- Parsing_Error: "The participant has a Mini-Mental State Examinations (MMSE) score of <= 24. psychiatric disease."
- Condition: "hypertension"
- Qualifier: "clinically significant"
- Subjective_judgement: "clinically significant"
- Condition: "reactions associated with ingestion of tyramine-rich food"
- Undefined_semantics: "reactions associated with ingestion of tyramine-rich food"
- Procedure: "neurosurgical intervention"
- Condition: "Parkinson's disease"
- Condition: "pallidotomy"
- Condition: "thalamotomy"
- Condition: "deep brain stimulation"
- Procedure: "transcranial magnetic stimulation"
- Temporal: "within 6 months"
- Drug: "selegiline"
- Drug: "pethidine"
- Drug: "tramadol"
- Drug: "reserpine"
- Drug: "methyldopa"
- Temporal: "within 90 days"
- Parsing_Error: "The participant has received transcranial magnetic stimulation within 6 months.The participant has received selegiline, pethidine, tramadol, reserpine or methyldopa within 90 days."
- Procedure: "levodopa monotherapy"
- Drug: "levodopa"
- Drug: "psychoneurotic agent"
- Drug: "antiemetic medication of dopamine agonist"
- Temporal: "within 14 days"
- Undefined_semantics: "antiemetic medication of dopamine agonist"
- Undefined_semantics: "psychoneurotic agent"
- Drug: "quetiapine"
- Drug: "domperidone"
- Qualifier: "stable dose"
- Temporal: ">= 14 days"
- Post-eligibility: "The participant is required to take any of the excluded medications or treatments."
- Context_Error: "The participant is required to take any of the excluded medications or treatments."
- Parsing_Error: "The participant with laboratory data meeting any of the following:"
- Measurement: "Creatinine"
- Value: ">= 2 x upper limit of normal (ULN)"
- Measurement: "Total bilirubin"
- Value: ">= 2 x ULN"
- Value: ">= 1.5 x ULN"
- Measurement: "AST"
- Measurement: "ALT"
- Measurement: "ALP"
- Value: ">= 3 x ULN"
- Post-eligibility: "The participant has received any of the excluded medications or treatments during."
- Context_Error: "The participant has received any of the excluded medications or treatments during."